Tromboembolic event (CVA or transient ischemic attack, AMI) less than 3 months prior to the intravitreal injection of bevacizumab

The above is a clinical trial exclusion criterion. Annotated with entity spans:
[Condition: Tromboembolic event] ([Condition: CVA] or [Condition: transient ischemic attack], [Condition: AMI]) [Temporal: less than 3 months prior to the intravitreal injection of bevacizumab]